Clinical trial exclusion criterion:
insufficient contraception (only for substudy 3)

Entity relations:
- Has_qualifier("contraception", "insufficient")